Subject had any previous cardiac surgery, e.g. prosthetic valves.

The above is a clinical trial exclusion criterion. Annotated with entity spans:
Subject had any previous [Procedure: cardiac surgery], e.g. [Device: prosthetic valves].